Clinical trial exclusion criterion:
Other indication for intrapartum antibiotics (endocarditis prophylaxis, other known maternal infection)

Annotated entities:
- Condition: "indication"
- Drug: "intrapartum antibiotics"
- Condition: "endocarditis prophylaxis"
- Condition: "maternal infection"